Clinical trial exclusion criterion:
Use of inhaled or topical steroids are not an exclusion criteria.

Entity relations:
- AND("not", "inhaled steroids")
- OR("inhaled steroids", "topical steroids")